下列何者為最常見的子宮頸癌的人類乳突病毒型？
A. 16、18
B. 6、11
C. 45、56
D. 31、33

正確答案：A. 16、18